Poor performance status

The above is a clinical trial exclusion criterion. Annotated with entity spans:
[Value: Poor] [Observation: performance status]